Clinical trial inclusion criterion:
Histologically confirmed diagnosis of melanoma, breast cancer or gynecologic cancer at MSKCC

Entity relations:
- Has_value("Histologically", "confirmed")
- AND("melanoma", "Histologically")
- AND("breast cancer", "Histologically")
- AND("gynecologic cancer", "Histologically")
- OR("melanoma", "breast cancer", "gynecologic cancer")